Clinical trial exclusion criterion:
Acquired thrombophilia.

Annotated entities:
- Condition: "thrombophilia"
- Qualifier: "Acquired"